對大多數人而言，腦部左側中大腦動脈（middle cerebral artery）嚴重阻塞，最容易發生下列何種失語症？
A. 全失語症（global aphasia）
B. 傳導型失語症（conduction aphasia）
C. 渥尼克失語症（Wernicke's aphasia）
D. 布洛卡失語症（Broca's aphasia）

正確答案：A. 全失語症（global aphasia）